若心室壁上的乳突肌（papillary muscle）麻痺或腱索（chordae tendinae）受損，最可能造成下列何種現象？
A. 房室瓣無法開啟
B. 房室瓣狹窄
C. 心室血液逆流回心房
D. 心室電位傳導異常

正確答案：C. 心室血液逆流回心房